Clinical trial exclusion criterion:
Presence of multiple factors that affect oral medications, such as difficulty swallowing, nausea, vomiting, chronic diarrhea and intestinal obstruction;

Entity relations:
- Has_context("difficulty swallowing", "factors that affect oral medications")
- OR("difficulty swallowing", "intestinal obstruction", "vomiting", "nausea", "chronic diarrhea")